Clinical trial exclusion criterion:
eye diseases or pathologies that prevent clear ophthalmoscopy and evaluation of study parameters, thus not allowing study participation according to the investigator´s judgment, such as (but not only) vitreous hemorrhage, mature cataract, macular pathologies other than diabetic maculopathy

Annotated entities:
- Negation: "prevent"
- Procedure: "ophthalmoscopy"
- Condition: "vitreous hemorrhage"
- Condition: "mature cataract"
- Condition: "macular pathologies"
- Negation: "other"
- Condition: "diabetic maculopathy"